use of any sedative hypnotics, tranquilizers, anticonvulsants, antihistamines (except non-sedating), benzodiazepines, clonidine or any medication known to affect dopamine at start of baseline period

The above is a clinical trial exclusion criterion. Annotated with entity spans:
use of any [Drug: sedative hypnotics], [Drug: tranquilizers], [Drug: anticonvulsants], [Drug: antihistamines] ([Negation: except] [Qualifier: non-sedating]), [Drug: benzodiazepines], [Drug: clonidine] or any [Drug: medication known to affect dopamine] [Temporal: at start of baseline period]